Clinical trial exclusion criterion:
A known allergy to Celecoxib, aspirin or another NSAID.

Entity relations:
- Has_qualifier("NSAID", "another")
- AND("allergy", "Celecoxib")
- OR("Celecoxib", "aspirin", "NSAID")